Patients who are 19 years or older on screening

The above is a clinical trial inclusion criterion. Annotated with entity spans:
Patients who are [Value: 19] [Person: years] or older [Temporal: on screening]